Clinical trial inclusion criterion:
Available Organ function: white blood cell=3.5×109/L, Neutrophils =1.5×109/L, Hemoglobin =80g/L, Blood platelet>100×109/L; Alanine aminotransferase (ALT) and Aspartate aminotransferase (AST)= 2.5 upper limit of normal(ULN); Total bilirubin (TBIL) <1.5 ULN;serum creatinine=1.5 ULN; creatinine clearance of = 50ml/min

Annotated entities:
- Measurement: "white blood cell"
- Value: "=3.5×109/L"
- Measurement: "Neutrophils"
- Value: "=1.5×109/L"
- Measurement: "Hemoglobin"
- Value: "=80g/L"
- Measurement: "Blood platelet"
- Value: ">100×109/L"
- Measurement: "Alanine aminotransferase (ALT)"
- Measurement: "Aspartate aminotransferase (AST)"
- Value: "= 2.5 upper limit of normal(ULN)"
- Measurement: "Total bilirubin (TBIL)"
- Value: "<1.5 ULN"
- Measurement: "serum creatinine"
- Value: "=1.5 ULN"
- Measurement: "creatinine clearance"
- Value: "= 50ml/min"